如果將兩個不同的 inbred strain 老鼠，A 及 B 品系交配而產生子代 F1，接著再將 F1 老鼠互相交配而得到子代 F2。此時如果將 F1 老鼠的皮膚移植到任一隻 F2 時，F1 老鼠的皮膚被 F2 老鼠接受的比例 （%）為何？
A. 100
B. 75
C. 50
D. 25

正確答案：C. 50